Clinical trial exclusion criterion:
Any disorder that compromises the ability of the patient to give written informed consent and/or comply with study procedures

Entity relations:
- Has_negation("give written informed consent", "compromises the ability of")
- Has_negation("disorder", "compromises the ability of")
- OR("give written informed consent", "comply with study procedures")